What is the typical outer diameter of microtubules (tubulin heterodimers)?

Microtubules are highly anisotropic structures built from tubulin heterodimers. They are hollow cylindrical shells with a ∼ 25 nm (24nm - 25nm) outer diameter.